Clinical trial inclusion criterion:
Patients with HBsAg negative, but HBcAb positive (regardless of HBsAb status) should have a HBV DNA testing performed and protocol eligibility determined as follow:

Entity relations:
- Has_value("HBsAg", "negative")
- Has_value("HBcAb", "positive")